一位 6 歲小男童因吃花生產生過敏性反應（anaphylaxis），最不適合接受何種治療？
A. 注射腎上腺素（epinephrine）
B. 給予氧氣
C. 給予抗組織胺
D. 給予非類固醇抗發炎劑（NSAID）

正確答案：D. 給予非類固醇抗發炎劑（NSAID）